Patients with anaemia (males Hb <130 g/L, females <120 g/L) undergoing elective cardiac surgery, and available to receive trial drug 1- 10 weeks prior to surgery

The above is a clinical trial inclusion criterion. Annotated with entity spans:
Patients with [Condition: anaemia] ([Person: males] [Measurement: Hb] [Value: <130 g/L], [Person: females] [Value: <120 g/L]) undergoing [Qualifier: elective] [Procedure: cardiac surgery], and [Mood: available to receive] [Drug: trial drug] [Temporal: 1- 10 weeks prior to surgery]